Mild OSA and patients with BMI over 40 kg/m2.

The above is a clinical trial exclusion criterion. Annotated with entity spans:
[Condition: Mild OSA] and patients with [Measurement: BMI] [Value: over 40 kg/m2].